La miltefosina y el antimoniato de meglumina se utilizan frente a:
1. Plasmodium falciparum.
2. Entamoeba histolytica.
3. Fasciola hepatica.
4. Leishmania.
5. Trichinella spiralis.

Respuesta correcta: 4. Leishmania.